resection should be more than two months,

The above is a clinical trial inclusion criterion. Annotated with entity spans:
[Condition: resection] should be [Temporal: more than two months],